Projected life expectancy less than 30 days

The above is a clinical trial exclusion criterion. Annotated with entity spans:
[Observation: Projected life expectancy] [Value: less than 30 days]